Allergy to povidone iodine.

The above is a clinical trial exclusion criterion. Annotated with entity spans:
[Condition: Allergy] to [Drug: povidone iodine].